Clinical trial exclusion criteria:
an underlying infectious disease
chromosomal abnormality
metabolic disorder
specific brain related disorder (such as tuberous sclerosis)
history of fetal cytomegalovirus infection
birth asphyxia
a history of major head injury
a chronic use of non-steroidal anti-inflammatory drugs, (NSAID)
known brain damage
Epilepsy
Abnormal Electro-cardiogram (ECG)
Epileptiform EEG
Use of psychostimulants, anti-depressants, neuroleptics or anti-convulsive agents within the past month.
Lack of cooperation in the screening phase

Annotated entities:
- Condition: "infectious disease"
- Qualifier: "underlying"
- Condition: "chromosomal abnormality"
- Condition: "metabolic disorder"
- Condition: "disorder"
- Qualifier: "brain"
- Condition: "tuberous sclerosis"
- Condition: "cytomegalovirus infection"
- Qualifier: "fetal"
- Condition: "birth asphyxia"
- Condition: "major head injury"
- Condition: "chronic use"
- Drug: "non-steroidal anti-inflammatory drugs"
- Drug: "NSAID"
- Condition: "brain damage"
- Condition: "Epilepsy"
- Measurement: "Electro-cardiogram"
- Measurement: "ECG"
- Value: "Abnormal"
- Measurement: "EEG"
- Value: "Epileptiform"
- Drug: "psychostimulants"
- Drug: "anti-depressants"
- Drug: "neuroleptics"
- Drug: "anti-convulsive agents"
- Temporal: "within the past month"
- Post-eligibility: "Lack of cooperation in the screening phase"